18. Cancer.

The above is a clinical trial exclusion criterion. Annotated with entity spans:
[Parsing_Error: 18.] [Condition: Cancer].